Clinical trial exclusion criterion:
11. History of portal hypertension or chronic liver disease, including positive serology for infection with HCV and/or HBV.

Annotated entities:
- Parsing_Error: "11."
- Condition: "portal hypertension"
- Condition: "chronic liver disease"
- Measurement: "serology for infection with HCV"
- Measurement: "serology for infection HBV"
- Value: "positive"